Clinical trial inclusion criterion:
2. Clinical diagnosis of type 1 diabetes for at least one year.

Entity relations:
- Has_temporal("type 1 diabetes", "for at least one year")